Clinical trial exclusion criterion:
Wolff Parkinson White syndrome

Annotated entities:
- Condition: "Wolff Parkinson White syndrome"